如果吞噬性白血球將微生物吞食後無法及時有效地將其殺死並且分解，免疫細胞將會聚集起來形成肉芽腫 （granuloma）。肉芽腫的中心經常被有一層排列整齊的單核白血球包圍。這層細胞是下列何者？
A. 上皮細胞（epithelial cells）
B. 類上皮細胞（epithelioid cells）
C. 漿細胞（plasma cells）
D. 壞死嗜中性白血球細胞及微生物

正確答案：B. 類上皮細胞（epithelioid cells）